Clinical trial inclusion criterion:
1. Patient is over 18 years old.

Entity relations:
- Has_value("years old", "over 18 years old")